Clinical trial exclusion criteria:
Previous vaginal delivery.
Submucous myoma.
Uterine anomalies.
Undiagnosed vaginal bleeding.
Pelvic inflammatory disease.

Annotated entities:
- Procedure: "vaginal delivery"
- Temporal: "Previous"
- Condition: "Submucous myoma"
- Condition: "Uterine anomalies"
- Condition: "vaginal bleeding"
- Qualifier: "Undiagnosed"
- Condition: "Pelvic inflammatory disease"